Clinical trial exclusion criterion:
6. Diagnosis of cognitive impairment from other causes (i.e., vitamine B12 and folic acid deficiency, thyroid disorders, metabolic diseases, head trauma, tumor or infections of the central nervous system, normal pressure hydrocephalus).

Annotated entities:
- Parsing_Error: "6."
- Condition: "cognitive impairment"
- Qualifier: "other causes"
- Condition: "vitamine B12 deficiency"
- Condition: "folic acid deficiency"
- Condition: "thyroid disorders"
- Condition: "metabolic diseases"
- Condition: "head trauma"
- Condition: "tumor of the central nervous system"
- Condition: "infections of the central nervous system"
- Condition: "normal pressure hydrocephalus"
- Undefined_semantics: "other causes"